下列血管炎中，何者與吸菸的關係最為密切，在疾病早期階段，戒菸可以緩解疾病的惡化？
A. Churg-Strauss syndrome
B. 結節性多動脈炎（polyarteritis nodosa）
C. 血栓閉塞性血管炎（thromboangiitis obliterans）
D. Henoch-Schönlein purpura

正確答案：C. 血栓閉塞性血管炎（thromboangiitis obliterans）